Patients with intrathecal injectio radiculalgia.

The above is a clinical trial exclusion criterion. Annotated with entity spans:
Patients with [Procedure: intrathecal injectio radiculalgia].